Clinical trial exclusion criterion:
Other skin diseases that might interfere with the efficacy evaluation;

Entity relations:
- Has_qualifier("skin diseases", "interfere with the efficacy evaluation")